Clinical trial inclusion criterion:
Cervical spine injury with functional loss in the upper extremity

Annotated entities:
- Condition: "Cervical spine injury"
- Observation: "functional loss"
- Qualifier: "upper extremity"